Hb level < 9gm/dl

The above is a clinical trial exclusion criterion. Annotated with entity spans:
[Measurement: Hb level] [Value: < 9gm/dl]